Clinical trial inclusion criterion:
Subject's age is between =12 and 16 years, inclusive

Annotated entities:
- Person: "age"
- Value: "between =12 and 16 years"
- Context_Error: "="
- Grammar_Error: "inclusive"